¿Qué criterios de calidad debe cumplir un instrumento de evaluación psicológica?
1. Validez, o grado en que las puntuaciones de una prueba están libres de error de medida.
2. Fiabilidad, o grado en que las puntuaciones de una prueba están libres de error de medida.
3. Tener un coeficiente de consistencia interna por encima de 0,40.
4. Contar con una baja proporción de la varianza observada explicada por la varianza real.
5. Incluir una elevada varianza de error.

Respuesta correcta: 2. Fiabilidad, o grado en que las puntuaciones de una prueba están libres de error de medida.